Clinical trial exclusion criterion:
Current use of Monoamine Oxidase Inhibitors (MAOIs), including the antibiotic linezolid and the thiazine dye methylthioninium chloride (methylene blue)

Entity relations:
- Subsumes("thiazine dye", "methylthioninium chloride")
- Subsumes("methylthioninium chloride", "methylene blue")
- Subsumes("Monoamine Oxidase Inhibitors (MAOIs)", "antibiotic linezolid")
- OR("antibiotic linezolid", "thiazine dye")